一位8歲小孩因為上課不專心，寫作業拖拖拉拉，忘東忘西而常被老師處罰來求診。下列那一項醫師之診斷行為較不恰當？
A. 詢問父母，此患者有無好動現象
B. 詢問父母，此患者是否在兩個情境以上有此現象
C. 詢問父母，此患者幾歲開始有此現象
D. 先安排影像學檢查（如CT, MRI）

正確答案：D. 先安排影像學檢查（如CT, MRI）